What are the outcomes of Renal sympathetic denervation?

Significant decreases and progressively higher reductions of systolic and diastolic blood pressure were observed after RSD. The complication rate was minimal.
Renal sympathetic denervation also reduces heart rate, which is a surrogate marker of cardiovascular risk.